Clinical trial inclusion criteria:
primigravida, singleton pregnancy, maternal age 18-35 years, and pregnancy duration 16-20 weeks at the time of study inclusion.

Annotated entities:
- Condition: "primigravida"
- Condition: "singleton pregnancy"
- Person: "maternal age"
- Value: "18-35 years"
- Measurement: "pregnancy duration"
- Value: "16-20 weeks"
- Temporal: "at the time of study inclusion"